neurological diseases

The above is a clinical trial exclusion criterion. Annotated with entity spans:
[Condition: neurological diseases]